Clinical trial exclusion criterion:
Family or personal history of medullary thyroid carcinoma

Annotated entities:
- Condition: "medullary thyroid carcinoma"
- Temporal: "personal history"
- Observation: "Family"